Clinical trial exclusion criterion:
History of gastrectomy, short bowel syndrome;

Entity relations:
- Has_temporal("gastrectomy", "History")
- OR("gastrectomy", "short bowel syndrome")